Clinical trial inclusion criterion:
Smokers, non-smokers or former-smokers

Entity relations:
- OR("Smokers", "former-smokers", "non-smokers")